body mass index less than 30 kg/m2

The above is a clinical trial inclusion criterion. Annotated with entity spans:
[Measurement: body mass index] [Value: less than 30 kg/m2]